接受大量 stored blood 的輸血後，不會造成下列何種不良反應？
A. 血中酸鹼值改變
B. 高血鉀現象
C. 低血鈣現象
D. 血中的 2,3-diphosphoglycerate 升高

正確答案：D. 血中的 2,3-diphosphoglycerate 升高